Patients with active illicit drug dependence

The above is a clinical trial exclusion criterion. Annotated with entity spans:
Patients with active [Condition: illicit drug dependence]